¿Cuál es el tipo de memoria que representa el conocimiento sobre cómo se hacen las cosas?:
1. Declarativa.
2. Episódica.
3. Semántica.
4. Procedimental.

Respuesta correcta: 4. Procedimental.